下列何者參與下肢本體覺的傳遞？
A. 外側頸核（lateral cervical nucleus）
B. 薄核（gracile nucleus）
C. 楔狀核（cuneate nucleus）
D. 弓狀核（arcuate nucleus）

正確答案：B. 薄核（gracile nucleus）